心肌梗塞的患者接受過運動訓練後，下列那個數值會降低？
A. 最大心輸出量（maximal cardiac output）
B. 次最大運動時心跳率（submaximal work heart rate）
C. 最大攝氧量（maximal oxygen uptake）
D. 休息時每次心搏出量（resting stroke volume）

正確答案：B. 次最大運動時心跳率（submaximal work heart rate）